Bajo la denominación de xantinas se agrupan:
1. La hoja de coca, la cocaína y el crack.
2. La metadona y la heroína.
3. El MDA y el MDMA.
4. La nicotina y los inhalantes.
5. La cafeína y la teofilina.

Respuesta correcta: 5. La cafeína y la teofilina.